Neural tube defect 的臨床表徵不包含下列那一項？
A. spina bifida occulta 常無明顯神經症狀
B. myelomenigocele 是最嚴重之一種表現，手術是必要且愈早愈好
C. dermoid sinus 常見於 cranial encephalocele
D. hydrocephalus 是常見於 myelomenigocele 的合併症

正確答案：C. dermoid sinus 常見於 cranial encephalocele